Is known to be infected with human immunodeficiency virus (HIV) or seropositive for hepatitis C virus (HCV)

The above is a clinical trial exclusion criterion. Annotated with entity spans:
Is known to be infected with [Condition: human immunodeficiency virus (HIV)] or [Condition: seropositive for hepatitis C virus (HCV)]